Clinical trial exclusion criteria:
With severe comorbidities, such as cardiovascular disease, chronic obstructive pulmonary disease, diabetes mellitus, and chronic renal dysfunction.
With bad compliance or contraindication to enrollment.
Pregnant woman or lactating woman.
With contraindication to receive adjuvant chemotherapy.

Annotated entities:
- Condition: "comorbidities"
- Qualifier: "severe"
- Condition: "cardiovascular disease"
- Undefined_semantics: "comorbidities"
- Condition: "chronic obstructive pulmonary disease"
- Condition: "diabetes mellitus"
- Condition: "chronic renal dysfunction"
- Grammar_Error: "and"
- Condition: "bad compliance"
- Subjective_judgement: "bad compliance"
- Condition: "contraindication to enrollment"
- Subjective_judgement: "contraindication to enrollment"
- Undefined_semantics: "contraindication to enrollment"
- Condition: "Pregnant"
- Person: "woman"
- Condition: "lactating"
- Person: "woman"
- Condition: "contraindication"
- Procedure: "adjuvant chemotherapy"
- Subjective_judgement: "contraindication"
- Undefined_semantics: "contraindication"